6. ECOG performance status of 0 to 2

The above is a clinical trial inclusion criterion. Annotated with entity spans:
6. [Measurement: ECOG performance status] of [Value: 0 to 2]